Clinical trial inclusion criterion:
Treating clinician deems infant eligible to receive 2-month vaccines

Entity relations:
- Has_mood("2-month vaccines", "eligible")